Clinical trial exclusion criterion:
Planned administration/ administration of a vaccine not foreseen by the study protocol during the period starting one month before each dose of vaccine(s) and ending 7 days after dose 1 and dose 2 or 1 month after dose 3.

Entity relations:
- Has_qualifier("vaccine", "not foreseen by the study protocol")
- Has_temporal("vaccine", "period starting one month before each dose of vaccine(s)")
- AND("Planned", "vaccine")
- Has_index("period starting one month before each dose of vaccine(s)", "each dose of vaccine(s)")
- Has_index("ending 7 days after dose 1 and dose 2", "dose 1 and dose 2")
- Has_index("1 month after dose 3", "dose 3")
- multi("dose 3", "dose 3")
- multi("dose 1 and dose 2", "dose 1")
- Has_temporal("vaccine", "ending 7 days after dose 1 and dose 2")
- OR("dose 1", "dose 2")
- OR("ending 7 days after dose 1 and dose 2", "1 month after dose 3")